29 歲女性，G1P0，妊娠 32 週，合併嚴重型子癇前症，以 MgSO4治療，應注意下列徵候以防「鎂中毒」，下列項目何者錯誤？
A. 尿液量（urine output）
B. 深腱反射（deep tendon reflex）
C. 呼吸數（respiratory rate）
D. 嘔吐（vomiting）

正確答案：D. 嘔吐（vomiting）